下列何者走在下肢的內側？
A. 大隱靜脈（great saphenous vein）
B. 小隱靜脈（small saphenous vein）
C. 膕靜脈（popliteal vein）
D. 股靜脈（femoral vein）

正確答案：A. 大隱靜脈（great saphenous vein）